Clinical trial inclusion criterion:
Subject is 65 years or older on the day of surgery

Annotated entities:
- Value: "65 years or older"
- Temporal: "on the day of surgery"
- Reference_point: "the day of surgery"
- Procedure: "surgery"
- Person: "older"